Active bleeding or at high risk for bleeding.

The above is a clinical trial exclusion criterion. Annotated with entity spans:
[Qualifier: Active] [Condition: bleeding] or [Mood: at high risk for] [Condition: bleeding].